Clinical trial exclusion criterion:
DSA > 1500 MFI

Entity relations:
- Has_value("DSA", "> 1500 MFI")